有關次發性高血壓的敘述，下列何者錯誤？
A. primary aldosteronism 常合併高血鉀
B. 最常見的次發性高血壓為腎實質病變（renal parenchymal disease）
C. 嗜鉻細胞瘤（pheochromocytoma）亦可發生在腎上腺外的組織
D. 睡眠呼吸障礙亦為次發性高血壓的原因之一

正確答案：A. primary aldosteronism 常合併高血鉀